Clinical trial exclusion criterion:
Requirement for renal support (either continuous or discontinuous techniques, including intermittent haemodialysis, haemofiltration and haemodiafiltration)

Annotated entities:
- Condition: "renal support"
- Mood: "Requirement for"